30歲男性病患，診斷為顱內出血，經治療後病患仍意識不清，病情不樂觀，家屬考量正統西醫療效停滯不 前，故另尋其他有機會改善病況之方法。由於病家有虔誠之民間宗教信仰，在請示神明後，向醫護人員要求
 灌食符水，在此種情況下，下列處置何者最為適當？
A. 醫護人員應該無條件協助灌食
B. 醫護人員應禁止家屬自行灌食
C. 醫護人員應主動指導家屬如何灌食
D. 醫護人員可要求家屬簽立切結書，容許家屬自行灌食

正確答案：D. 醫護人員可要求家屬簽立切結書，容許家屬自行灌食